What is trichotillomania?

Trichotillomania is a hair pulling disorder.